Clinical trial exclusion criterion:
Liver disease (abnormal liver enzymes)

Annotated entities:
- Condition: "Liver disease"
- Measurement: "liver enzymes"
- Value: "abnormal"